Los macrólidos inhiben la síntesis de:
1. La cápsula.
2. El peptidoglicano.
3. El lipopolisacárido.
4. Las proteínas.

Respuesta correcta: 4. Las proteínas.